Clinical trial inclusion criterion:
Above 18 years of age

Annotated entities:
- Person: "age"
- Value: "Above 18 years"